Cuando en un estudio se comparan dos tratamientos se suele calcular la diferencia entre las medias obtenidas por cada tratamiento y se divide por la desviación típica conjunta ¿Cómo se denomina este cómputo?:
1. Metaanálisis.
2. Tamaño del efecto.
3. Porcentaje de pacientes recuperados.
4. Índice de cambio fiable.

Respuesta correcta: 2. Tamaño del efecto.